What are the side effects during statins administration in patients with atherosclerosis?

The side effects during statins administration in patients with atherosclerosis are:
1) Myopathy
2) Transaminase elevations
3) Diabetes mellitus 
4) Renal and neurologic adverse effects.